What happens to H2AX upon DNA bouble strand breaks?

phosphorylated h2ax (γh2ax) is rapidly concentrated in chromatin domains around dna double-strand breaks (dsbs) after the action of ionizing radiation or chemical agents and at stalled replication forks during replication stress.